Clinical trial inclusion criterion:
19-65 years of age

Annotated entities:
- Value: "19-65 years"
- Person: "age"